一位 50 歲女性過去曾被發現有膽囊結石。昨天夜裡突然上腹部（epigastric region）開始劇痛，伴有噁心、嘔吐及腹脹等症狀；她的腹痛在平躺時會加劇，屈膝彎腰時腹痛會較緩解。身體診察時，聽不到腸音，腹部有輕微壓痛，但無反彈痛（rebound pain），左側腰部皮膚上可見一塊綠褐色區域。 下列各項敘述，何者錯誤？
A. 此病人之病情可能與膽囊結石有關
B. 抽血檢驗很可能會發現澱粉酶（amylase）明顯異常上升
C. 對此等病人，住院後 24 小時內應注意其 Ranson's criteria 及 APACHE II score 等，判斷其嚴重度
D. 治療此等病人以手術為首要選擇

正確答案：D. 治療此等病人以手術為首要選擇